Clinical trial exclusion criterion:
Cases with history of gastric ulcer diagnosed by upper endoscopy.

Entity relations:
- Has_temporal("gastric ulcer", "history")
- AND("gastric ulcer", "upper endoscopy")